occasional use of pipes is permitted if subject abstains for the week prior to the study

The above is a clinical trial exclusion criterion. Annotated with entity spans:
o[Non-query-able: ccasional use of pipes is permitted if subject abstains for the week prior to the study]